Clinical trial inclusion criteria:
Age of = 18 years of age and able to give written informed consent;
Active chronic central serous chorioretinopathy (cCSC);
Subjective visual loss > 6 weeks, interpreted as onset of active disease;
Foveal subretinal fluid (SRF), on optical coherence tomography (OCT), at Baseline Examination;
=1 ill-defined hyperfluorescent leakage areas on fluorescein angiography (FA) with retinal pigment epithelial window defect(s) that are compatible with cCSC;
Hyperfluorescent areas on indocyanine green angiography (ICGA).

Annotated entities:
- Person: "Age"
- Value: "= 18 years"
- Observation: "able to give written informed consent"
- Qualifier: "Active"
- Qualifier: "chronic"
- Condition: "central serous chorioretinopathy (cCSC)"
- Condition: "Subjective visual loss"
- Temporal: "> 6 weeks"
- Non-representable: "interpreted as onset of active disease;"
- Condition: "Foveal subretinal fluid (SRF)"
- Procedure: "optical coherence tomography (OCT)"
- Temporal: "at Baseline Examination"
- Reference_point: "Baseline Examination"
- Multiplier: "=1"
- Qualifier: "ill-defined"
- Condition: "hyperfluorescent leakage areas"
- Procedure: "fluorescein angiography (FA)"
- Condition: "retinal pigment epithelial window defect(s)"
- Non-representable: "that are compatible with cCSC"
- Condition: "Hyperfluorescent areas"
- Procedure: "indocyanine green angiography (ICGA)"